在動物中經由肌肉細胞代謝過程所產生的 ammonia，藉由何者運輸到 liver 進行尿素循環（Urea cycle）？
A. alanine
B. glycine
C. serine
D. cysteine

正確答案：A. alanine